傷寒桿菌（Salmonella Typhi）的重要毒力因素，也被用以製成疫苗的 Vi 抗原所含的成分是：
A. 溶血素（hemolysin）
B. 莢膜多糖體（capsular polysaccharides）
C. 胜肽聚糖（peptidoglycan）
D. 鞭毛素（flagellin）

正確答案：B. 莢膜多糖體（capsular polysaccharides）